一位 16 歲女性，拔牙後出血不止，全血球檢查顯示紅血球及白血球無異常，血小板為 185,000/μL，出血時間 11 分，凝血酶原時間（PT）11 秒，部分凝血活酶時間（PTT）63 秒。這位女孩最可能是有什麼問題？
A. Glanzmann's thrombasthenia
B. von Willebrand's disease
C. chronic renal failure
D. Aspirin uptake

正確答案：B. von Willebrand's disease